Clinical trial inclusion criterion:
previous allergic reaction to antibiotics (bismuth, amoxicillin, metronidazole, clarithromycin, tetracycline) and PPI (esomeprazole),

Annotated entities:
- Drug: "bismuth"
- Drug: "amoxicillin"
- Drug: "metronidazole"
- Drug: "clarithromycin"
- Drug: "tetracycline"
- Drug: "PPI"
- Drug: "esomeprazole"
- Drug: "antibiotics"
- Temporal: "previous"
- Condition: "allergic reaction"